下列有關COPD病生理的敘述，何者錯誤？
A. COPD的炎症反應常會引起全身性的共病（co-morbidities）
B. COPD患者的肺功能異常是由於慢性炎症所造成的結構性變化，長期的使用抗發炎藥物如  	類固醇，幾乎可以完全恢復
C. COPD也可能發生於非抽煙者
D. 參與COPD的發炎反應的發炎介質很多，包括IL-8, TNF-α, IL-1β

正確答案：B. COPD患者的肺功能異常是由於慢性炎症所造成的結構性變化，長期的使用抗發炎藥物如  	類固醇，幾乎可以完全恢復